Pathological dry eye or associated findings

The above is a clinical trial exclusion criterion. Annotated with entity spans:
[Condition: Pathological dry eye] or [Condition: associated findings]